6. Hemoglobin < 10 Gms/dL.

The above is a clinical trial exclusion criterion. Annotated with entity spans:
6. [Measurement: Hemoglobin] [Value: < 10 Gms/dL].